下列藥物之作用機制為抑制細菌細胞壁之生合成，何者除外？
A. cycloserine
B. cephalexin
C. clindamycin
D. bacitracin

正確答案：C. clindamycin